Clinical trial inclusion criterion:
Treated with Ursodeoxycholic Acid in West China Hospital for at least 6 month and suboptimal response to Ursodeoxycholic Acid

Entity relations:
- AND("suboptimal response", "Ursodeoxycholic Acid")
- Has_temporal("Ursodeoxycholic Acid", "for at least 6 month")
- AND("Ursodeoxycholic Acid", "West China Hospital")